patients with twin pregnancy;

The above is a clinical trial exclusion criterion. Annotated with entity spans:
patients with [Qualifier: twin] [Condition: pregnancy];